Si una muestra de tamaño 100 tiene una desviación típica de 10, su error típico es:
1. 10.
2. 100.
3. 0,1.
4. 1.
5. No hay datos suficientes para calcularlo.

Respuesta correcta: 4. 1.